Clinical trial inclusion criterion:
Meet the clinical (Amsel) criteria for BV

Annotated entities:
- Condition: "BV"
- Qualifier: "criteria clinical"
- Qualifier: "Amsel criteria"